有關胃手術後之併發症敘述，下列何者錯誤？
A. 早期的 Dumping 症候群之症狀與低血糖的症狀完全相符，例如出冷汗、心跳加快、飢餓性震顫、全身軟弱無力及昏迷等
B. 腸吻合進入口之阻塞，其發生的症狀有嘔吐後腹痛解緩、吐膽汁、血中胰澱粉酶升高、黃疸、脂肪痢等
C. 代謝性缺鈣的病患，接受 Billroth II 吻合術之患者多於 Billroth I 吻合術的患者
D. 近端腸過長是復發性潰瘍發生的原因之一

正確答案：A. 早期的 Dumping 症候群之症狀與低血糖的症狀完全相符，例如出冷汗、心跳加快、飢餓性震顫、全身軟弱無力及昏迷等